Abnormal serum glucose levels either at fasting or after the 2-hr oral glucose tolerance test meeting criteria for the diagnosis of diabetes mellitus according to the American Diabetes Association.

The above is a clinical trial exclusion criterion. Annotated with entity spans:
[Condition: Abnormal serum glucose levels] either [Temporal: at fasting] or [Temporal: after the 2-hr oral glucose tolerance test] [Qualifier: meeting criteria for the diagnosis of diabetes mellitus according to the American Diabetes Association].